一位 60 歲健康男性，定期體檢時理學檢查發現攝護腺左葉有一個 0.5 公分硬塊，血清攝護腺特定抗原為 5 ng/mL。切片證實為腺癌，局限在左葉，格理森總數（Gleason score）為 4+3；核醫骨骼掃描及電腦斷層顯示沒有骨骼及淋巴結轉移。其最適當的治療是：
A. 保留神經之攝護腺根除手術
B. 睪丸切除術
C. 化學藥物治療
D. 不須治療，觀察即可

正確答案：A. 保留神經之攝護腺根除手術